Emergency surgery

The above is a clinical trial exclusion criterion. Annotated with entity spans:
[Procedure: Emergency surgery]